Clinical trial exclusion criterion:
Blood pressure averaging > 159/99 mmHg

Entity relations:
- Has_value("Blood pressure", "> 159/99 mmHg")